下列對照的致癌原（Carcinogen）何者錯誤？
A. 黃麴毒素（Aflatoxins）－肝癌（Hepatocellular carcinoma）
B. 幽門螺旋桿菌（Helicobacter pylori）－胃腺癌（Gastric adenocarcinoma）
C. Epstein-Barr virus－鼻咽癌（Nasopharyngeal carcinoma）
D. Tamoxifen－乳癌（Breast cancer）

正確答案：D. Tamoxifen－乳癌（Breast cancer）